KPS ≥ 60

The above is a clinical trial inclusion criterion. Annotated with entity spans:
[Measurement: KPS] [Value: ≥ 60]